Clinical trial exclusion criterion:
Inpatient procedures for active GI bleeding

Annotated entities:
- Procedure: "Inpatient procedures"
- Condition: "GI bleeding"
- Qualifier: "active"